Un chico de 22 años de edad con hiposmia presenta falta de desarrollo de caracteres sexuales secundarios e infertilidad. Volumen testicular de 4 mL bilateral. Analíticamente, FSH 1,2 U/L (vn 5-15); LH 0,6 U/L (vn 3-15); testosterona 100 ng/dL (vn 300-1200), prolactina normal. Señale el tratamiento que le propondrá para conseguir fertilidad:
1. Bomba de infusión de GnRH.
2. Administración intramuscular mensual de triptorelina.
3. Administración intramuscular de FSH y LH una vez por semana.
4. Tratamiento con bromocriptina.

Respuesta correcta: 1. Bomba de infusión de GnRH.